Clinical trial exclusion criterion:
Current Axis I primary psychiatric diagnosis other than major depressive disorder.

Annotated entities:
- Condition: "psychiatric diagnosis"
- Qualifier: "primary"
- Qualifier: "Axis I"
- Negation: "other than"
- Condition: "major depressive disorder"